Poor glucose control (HbA1C>10 %)

The above is a clinical trial exclusion criterion. Annotated with entity spans:
[Condition: Poor glucose control] ([Measurement: HbA1C][Value: >10 %])